Antonio es un adulto joven diagnosticado de depresión desde hace dos años. Actualmente trabaja como comercial pero está teniendo múltiples problemas con uno de sus compañeros de trabajo. El rol de la enfermera se centra en ser una presencia comprensiva para Antonio. De acuerdo con el modelo conceptual de Dorothea Orem, indique qué método de ayuda utiliza la enfermera para compensar la limitación de acción de Antonio.
1. Actuar por otra persona.
2. Guiar y dirigir.
3. Proporcionar soporte psicológico.
4. Proporcionar y mantener un entorno que fomente el desarrollo personal.

Respuesta correcta: 3. Proporcionar soporte psicológico.